¿Cuál de los siguientes fármacos NO está indicado en el tratamiento del Asma Bronquial?:
1. Fármacos bloqueantes alfa adrenérgicos.
2. Fármacos estimulantes beta dos adrenérgicos de acción corta.
3. Fármacos estimulantes beta dos adrenérgicos de acción larga.
4. Glucorticoides.

Respuesta correcta: 1. Fármacos bloqueantes alfa adrenérgicos.